creatinine level of 1,5 mg/dL or more

The above is a clinical trial exclusion criterion. Annotated with entity spans:
[Measurement: creatinine level] of [Value: 1,5 mg/dL or more]